Clinical trial inclusion criterion:
Male or non-pregnant female between the ages of 18-65

Entity relations:
- Has_qualifier("female", "pregnant")
- Has_negation("pregnant", "non")
- Has_value("ages", "18-65")